Clinical trial exclusion criterion:
A significant risk of suicide corroborated by a score of =5 on item 10(suicidal thoughts) on the MADRS scale or by clinical judgment of the investigator

Annotated entities:
- Observation: "risk of suicide"
- Qualifier: "significant"
- Measurement: "MADRS scale"
- Value: "score of =5 on item 10"
- Non-query-able: "by clinical judgment of the investigator"